Se ha llevado a cabo un estudio con el fin de determinar el riesgo de hemorragia digestiva alta (HDA) asociado con el uso de diferentes anti-inflamatorios no esteroideos (AINE). Para ello se incluyeron 2.777 pacientes con HDA y 5.532 pacientes emparejados con los anteriores por edad y mes de ingreso o consulta, en los mismos hospitales, pero por razones que no tuvieran nada que ver con el uso de AINE. Se calculó el riesgo comparativo de sufrir una HDA asociado a la exposición previa a diferentes AINE. ¿De qué tipo de estudio se trata?
1. Estudio de cohortes.
2. Estudio de casos y controles.
3. Estudio transversal.
4. Estudio experimental.
5. Estudio ecológico.

Respuesta correcta: 2. Estudio de casos y controles.